Clinical trial exclusion criterion:
Acute or severe medical illness, i.e., delirium, metastatic cancer, decompensated cardiac, liver or kidney failure, major surgery, stroke or myocardial infarction during the three months prior to entry; or use of drugs known to cause depression, e.g., reserpine, alpha-methyl-dopa, steroids, sympathomimetics withdrawal;

Annotated entities:
- Condition: "medical illness"
- Qualifier: "Acute"
- Qualifier: "severe"
- Condition: "delirium"
- Condition: "metastatic cancer"
- Qualifier: "decompensated"
- Condition: "cardiac failure"
- Condition: "liver failure"
- Condition: "kidney failure"
- Procedure: "major surgery"
- Condition: "stroke"
- Condition: "myocardial infarction"
- Temporal: "three months prior to entry"
- Reference_point: "entry"
- Drug: "drugs"
- Condition: "depression"
- Drug: "reserpine"
- Drug: "alpha-methyl-dopa"
- Drug: "steroids"
- Condition: "sympathomimetics withdrawal"